Previous significant adverse reaction to naltrexone or diluent

The above is a clinical trial exclusion criterion. Annotated with entity spans:
[Temporal: Previous] [Qualifier: significant] [Condition: adverse reaction] to [Drug: naltrexone] or [Drug: diluent]